Clinical trial exclusion criterion:
Triglycerides =500 mg/dL

Entity relations:
- Has_value("Triglycerides", "=500 mg/dL")